over 18 years of age

The above is a clinical trial inclusion criterion. Annotated with entity spans:
[Value: over 18 years] of [Person: age]